Clinical trial inclusion criterion:
Lobectomy or pneumonectomy

Entity relations:
- OR("Lobectomy", "pneumonectomy")